immune deficient state

The above is a clinical trial exclusion criterion. Annotated with entity spans:
[Condition: immune deficient state]